Clinical trial inclusion criterion:
currently receiving a stable antiretroviral regimen comprising of:

Annotated entities:
- Procedure: "antiretroviral regimen"